How does Dst1 knock-out affect transcription in yeast?

While TFIIS has a pronounced effect on transcription elongation in vitro, the deletion of DST1 has no major effect on cell viability.